關於Ulcerative colitis及Crohn's disease的比較，下列何者正確？
A. 在內視鏡下，ulcerative colitis常有rectal sparing的現象，Crohn's disease則較罕見
B. 在內視鏡下，ulcerative colitis常有cobblestoning的黏膜變化，Crohn's disease則較罕見
C. 在放射線檢查下，ulcerative colitis不會呈現segmental colitis的現象，而Crohn's disease常會有此現象的發
D. 在臨床理學檢查下，ulcerative colitis常見significant perineal disease的症狀，而Crohn's disease罕有此症狀的發生

正確答案：C. 在放射線檢查下，ulcerative colitis不會呈現segmental colitis的現象，而Crohn's disease常會有此現象的發